Clinical trial exclusion criterion:
allergies to any medications used in the study

Annotated entities:
- Condition: "allergies"
- Drug: "medications used in the study"